Clinical trial exclusion criterion:
Female sterilization (have had surgical bilateral oophorectomy with or without hysterectomy) or tubal ligation at least six weeks before taking study treatment. In case of oophorectomy alone, only when the reproductive status of the woman has been confirmed by follow up hormone level assessment

Annotated entities:
- Procedure: "Female sterilization"
- Procedure: "bilateral oophorectomy"
- Procedure: "hysterectomy"
- Procedure: "tubal ligation"
- Temporal: "at least six weeks before taking study treatment"
- Reference_point: "taking study treatment"
- Non-query-able: "In case of oophorectomy alone, only when the reproductive status of the woman has been confirmed by follow up hormone level assessment"